El bromuro de etidio es una molécula que tiene un rendimiento cuántico de fluorescencia muy bajo en disolución. Sin embargo, su rendimiento cuántico aumenta notablemente cuando:
1. Se atomiza.
2. Se intercala entre pares de bases consecutivos de la doble hélice de ADN.
3. Se oxigena la disolución acuosa que la contiene.
4. Se une a un metal pesado formando un complejo.
5. Se oxida por acción de la enzima gluocosaoxidasa.

Respuesta correcta: 2. Se intercala entre pares de bases consecutivos de la doble hélice de ADN.